History of seizures

The above is a clinical trial exclusion criterion. Annotated with entity spans:
[Temporal: History] of [Condition: seizures]